Capable of giving written informed consent, which includes compliance with the requirements and restrictions listed in the consent form

The above is a clinical trial inclusion criterion. Annotated with entity spans:
[Non-query-able: Capable of giving written informed consent, which includes compliance with the requirements and restrictions listed in the consent form]